¿Cuál de las siguientes aseveraciones sobre el tratamiento coadyuvante tras la cirugía del cáncer de mama es correcta?
1. El uso de tamoxifeno depende del estado ganglionar.
2. El tamoxifeno se debe de iniciar a la vez que la quimioterapia.
3. El inhibidor de aromatasa es efectivo con función ovárica activa.
4. La monoterapia con tamoxifeno es útil en pre y postmenopaúsicas.

Respuesta correcta: 4. La monoterapia con tamoxifeno es útil en pre y postmenopaúsicas.